Clinical trial exclusion criterion:
Iodinated contrast allergy that, in the opinion of the Investigator, cannot be adequately premedicated

Entity relations:
- AND("allergy", "Iodinated contrast")